下列何者不會造成慢性腎衰竭急性惡化？
A. 體液不足（volume depletion）
B. 心臟衰竭惡化（aggravating heart failure）
C. 高血糖
D. l 高血壓

正確答案：C. 高血糖